Primary diagnosis for current hospitalization is unrelated to worsening lower respiratory symptoms (e.g., pulmonary clean out, distal intestinal obstruction syndrome (DIOS), sinusitis)

The above is a clinical trial exclusion criterion. Annotated with entity spans:
[Condition: Primary diagnosis] for [Observation: current hospitalization] is [Negation: unrelated] to [Qualifier: worsening] [Condition: lower respiratory symptoms] (e.g., [Condition: pulmonary clean out], [Condition: distal intestinal obstruction syndrome] ([Condition: DIOS]), [Condition: sinusitis])